相同劑量的局部麻醉藥物 lidocaine 分別注入 intercostals、caudal、epidural、brachial plexus 時，何部位的藥物吸收最好、容易產生毒性反應？
A. intercostals
B. caudal
C. epidural
D. brachial plexus

正確答案：A. intercostals